Patient able to speak and understand Thai

The above is a clinical trial inclusion criterion. Annotated with entity spans:
[Post-eligibility: Patient able to speak and understand Thai]